Clinical trial inclusion criterion:
Body mass index (BMI; weight [kilogram(kg)]/height^2 [meter square (m^2)]) between 18 and 30 kg/m^2, (inclusive)

Annotated entities:
- Measurement: "Body mass index"
- Value: "between 18 and 30 kg/m^2"
- Measurement: "BMI"
- Measurement: "weight [kilogram(kg)]/height^2 [meter square (m^2)]"
- Not_a_criteria: "BMI; weight [kilogram(kg)]/height^2 [meter square (m^2)]"